下列有關泌尿系統外傷的敘述，何者正確？
A. 懷疑尿道外傷時應儘速放置導尿管
B. 陰莖白膜斷裂需緊急開刀修補白膜（tunica albuginea）
C. 一旦有 microscopic hematuria 便需急做腹部電腦斷層掃描（CT scan）
D. 血尿程度與腎臟外傷程度成正相關性

正確答案：B. 陰莖白膜斷裂需緊急開刀修補白膜（tunica albuginea）